De los siguientes mecanismos de reacción ¿en cuál se produce una inversión de la configuración desde el reactivo al producto de la reacción?:
1. Sustitución nucleofílica bimolecular (SN2).
2. Eliminación unimolecular (E1).
3. Sustitución nucleofílica unimolecular (SN1).
4. Adición Markovnikov.
5. Adición anti-Markovnikov.

Respuesta correcta: 1. Sustitución nucleofílica bimolecular (SN2).